Clinical trial inclusion criterion:
Participants must be considered by their physician eligible to receiving the IRD regimen.

Entity relations:
- Has_mood("IRD regimen", "eligible to")